Clinical trial inclusion criterion:
INR known to be greater than 1.5 at the time of screening

Entity relations:
- Has_index("at the time of screening", "the time of screening")
- Has_value("INR", "greater than 1.5")
- Has_temporal("INR", "at the time of screening")